當發生腕隧道症候群（carpal tunnel syndrome）時，手掌大拇指的那一條肌腱最可能受到影響？
A. 伸拇指長肌（extensor pollicis longus）
B. 屈拇指長肌（flexor pollicis longus）
C. 外展拇指長肌（abductor pollicis longus）
D. 內收拇指肌（adductor pollicis）

正確答案：B. 屈拇指長肌（flexor pollicis longus）